Clinical trial inclusion criterion:
Presents with anxiety (Hamilton Anxiety Rating Scale = 18) at the time of study entry

Annotated entities:
- Condition: "anxiety"
- Measurement: "Hamilton Anxiety Rating Scale"
- Value: "= 18"
- Temporal: "at the time of study entry"
- Reference_point: "time of study entry"